Clinical trial exclusion criterion:
immunosuppression including AIDS, corticosteroids over 60mg/day

Entity relations:
- Has_multiplier("corticosteroids", "over 60mg/day")
- Subsumes("immunosuppression", "AIDS")
- OR("AIDS", "corticosteroids")